Respecto a Paragonimus westermani podemos afirmar que:
1. Miden más de 20 milímetros de longitud.
2. El ovario y los testículos están localizados en un extremo.
3. Se puede establecer el diagnóstico por la presencia de huevos en esputo y heces.
4. Sus huevos son embrionados.

Respuesta correcta: 3. Se puede establecer el diagnóstico por la presencia de huevos en esputo y heces.